Refusal of participant [or parent/guardian]

The above is a clinical trial exclusion criterion. Annotated with entity spans:
[Informed_consent: Refusal of participant [or parent/guardian]]